La epidemiología permite detectar precozmente los cambios en la incidencia de una determinada enfermedad en la población. Para ello, lo más correcto es utilizar:
1. La investigación etiológica.
2. La descripción de la historia natural de la enfermedad.
3. La vigilancia epidemiológica.
4. La evaluación del funcionamiento de los servicios.
5. Ninguna de las respuestas anteriores es correcta.

Respuesta correcta: 3. La vigilancia epidemiológica.